Chico de 16 años que consulta por presentar amigdalitis pultácea, fiebre de hasta 38,5ºC, adenopatías cervicales dolorosas, exantema macular no pruriginoso en tórax y hepatoesplenomegalia leves, de 4-5 días de evolución. El test de Paul-Bunnell y la IgM para el virus de Epstein-Barr son positivos. Durante su ingreso desarrolla fiebre continua de hasta 40ºC, pancitopenia, hepatitis ictérica y coagulopatía de intensidad progresiva. A la semana del ingreso, se traslada a UCI por confusión e insuficiencia respiratoria. Los hemocultivos y un urocultivo son negativos, el LCR es normal y la placa de tórax no muestra infiltrados. La procalcitonina es normal, pero PCR y ferritina están muy elevados. De los enunciados a continuación, ¿cuál sería el planteamiento diagnóstico y terapéutico más correcto?
1. Tiene una sepsis bacteriana de origen indeterminado y se debe administrar ceftriaxona y tratamiento de soporte.
2. Tiene una sepsis bacteriana de origen indeterminado y se debe administrar vancomicina, ceftacidima y tratamiento de soporte.
3. Se trata de una mononucleosis infecciosa de curso grave y se deben de administrar glucocorticoides.
4. Se trata de una mononucleosis infecciosa de curso grave y se debe iniciar tratamiento con aciclovir.
5. Realizaría una biopsia/aspirado de médula ósea y si se confirma hemofagocitosis, iniciaría tratamiento con inmunosupresores.

Respuesta correcta: 5. Realizaría una biopsia/aspirado de médula ósea y si se confirma hemofagocitosis, iniciaría tratamiento con inmunosupresores.